Clinical trial inclusion criterion:
Histologic diagnosis of chondrosarcoma, verifiable after enrollment

Annotated entities:
- Condition: "chondrosarcoma"
- Measurement: "Histologic"